Clinical trial exclusion criterion:
Major bleeding history within prior 2 months

Entity relations:
- Has_temporal("Major bleeding history", "within prior 2 months")